Difficulty in communication due to language issues

The above is a clinical trial exclusion criterion. Annotated with entity spans:
[Condition: Difficulty in communication] due to [Condition: language issues]